Clinical trial exclusion criterion:
Pregnant women

Annotated entities:
- Person: "women"
- Condition: "Pregnant"